Clinical trial inclusion criteria:
Male or non-pregnant female between the ages of 18-65
Patients willing and able to sign the informed consent
Patients able to comply with follow-up requirements including self-evaluations
Patients requiring a primary total knee replacement
Patients with a diagnosis of osteoarthritis, traumatic arthritis, or avascular necrosis

Annotated entities:
- Person: "Male"
- Person: "female"
- Qualifier: "pregnant"
- Negation: "non"
- Person: "ages"
- Value: "18-65"
- Informed_consent: "Patients willing and able to sign the informed consent"
- Post-eligibility: "atients able to comply with follow-up requirements including self-evaluations"
- Procedure: "primary total knee replacement"
- Condition: "osteoarthritis"
- Condition: "traumatic arthritis"
- Condition: "avascular necrosis"